Clinical trial exclusion criterion:
2. Antifungals: itraconazole, ketoconazole, voriconazole

Entity relations:
- OR("itraconazole", "ketoconazole", "voriconazole")